脊椎轉移性腫瘤最常侵犯那一部位脊椎？
A. 頸椎
B. 胸椎
C. 腰椎
D. 薦椎

正確答案：B. 胸椎